下列有關骨腫瘤與年齡之間的敘述，何者正確？
A. 骨肉瘤（Osteosarcoma）最常發生於青少年和中年人
B. Ewing 氏肉瘤最常發生在青少年和年輕成人
C. 巨大細胞瘤最常發生於青少年和中年人
D. 軟骨肉瘤最常發生於青少年和年輕成人

正確答案：B. Ewing 氏肉瘤最常發生在青少年和年輕成人